無論是交感神經或副交感神經興奮的作用，均可促進下列那一個腺體的分泌？
A. salivary glands
B. adrenal glands
C. gastric glands
D. acini of pancreas

正確答案：A. salivary glands